Male or female =18 years of age at Visit 1

The above is a clinical trial inclusion criterion. Annotated with entity spans:
[Person: Male] or [Person: female] [Value: =18 years] of [Person: age] [Temporal: at Visit 1]